Clinical trial inclusion criterion:
Sensitive to the product or other genetically engineered biological products from Escherichia coli strains.

Annotated entities:
- Condition: "Sensitive"
- Drug: "the product"
- Qualifier: "other"
- Drug: "genetically engineered biological products"
- Qualifier: "Escherichia coli strains"